Clinical trial exclusion criterion:
Has a history of (non-infectious) pneumonitis that required steroids or current pneumonitis

Entity relations:
- AND("non-infectious) pneumonitis", "steroids")
- Has_temporal("pneumonitis", "current")
- Has_temporal("non-infectious) pneumonitis", "history")
- OR("steroids", "pneumonitis")